What is Telangiectasia?

Telangiectasias are small focal red macules and papules created by abnormally prominent capillaries, venules, and arterioles Telangiectasia (macroscopically visible dilated skin vessels)